Progressive neurological or neuromuscular disorders having a major impact on exercise capacity

The above is a clinical trial exclusion criterion. Annotated with entity spans:
Progressive neurological or [Condition: neuromuscular disorders] having a major [Condition: impact on exercise capacity]